Clinical trial inclusion criterion:
dental extraction performed at least 3 month prior

Annotated entities:
- Procedure: "dental extraction"
- Temporal: "at least 3 month prior"